Clinical trial exclusion criterion:
Patients allergic to any medication given in either arm (list medications)

Annotated entities:
- Condition: "allergic"
- Drug: "medication"